Unable to commit to intervention for duration of protocol

The above is a clinical trial exclusion criterion. Annotated with entity spans:
[Post-eligibility: Unable to commit to intervention for duration of protocol]